Clinical trial inclusion criterion:
New York Heart Association (NYHA) heart function classification is I-II grade

Entity relations:
- Has_value("New York Heart Association heart function classification", "I-II grade")
- Subsumes("New York Heart Association heart function classification", "NYHA")